Histologic or cytologic diagnosis of stage IIIB/IV NSCLC

The above is a clinical trial inclusion criterion. Annotated with entity spans:
[Procedure: Histologic] or [Procedure: cytologic] diagnosis of [Qualifier: stage IIIB/IV] [Condition: NSCLC]